El término “enriquecimiento de uranio” alude al aumento de la:
1. Cantidad de uranio presente en una mena natural para poder explotarla.
2. Cantidad del isótopo 235U respecto a la abundancia isotópica natural.
3. Cantidad del isótopo 238U respecto a la abundancia isotópica natural.
4. Capacidad de uranio presente en su fluoruro.
5. Masa atómica del uranio.

Respuesta correcta: 2. Cantidad del isótopo 235U respecto a la abundancia isotópica natural.